4. Presence of medical conditions that might interfere with participation, or where participation would be contraindicated

The above is a clinical trial exclusion criterion. Annotated with entity spans:
4. [Context_Error: Presence of medical conditions that might interfere with participation, or where participation would be contraindicated]